Patients aged 7 years and older must have provided written assent accompanied by written informed consent from patient's representative

The above is a clinical trial inclusion criterion. Annotated with entity spans:
Patients [Person: aged] [Value: 7 years and older] [Post-eligibility: must have provided written assent accompanied by written informed consent from patient's representative]